Clinical trial exclusion criterion:
Contraindication to Clopidogrel

Entity relations:
- AND("Contraindication", "Clopidogrel")